25 歲男性病人從小就呈現慢性進展的腎臟病。病人多次出現臉及下肢浮腫。最近二年又發生肉眼可見的血尿。聽力檢查發現雙邊的聽力不正常。他唯一的兄弟也在 17 歲時死於慢性的腎臟疾病。下列疾病中那一個最符合其臨床表現？
A. Thin basement membrane disease
B. Alport syndrome
C. IgA nephropathy
D. Focal segmental glomerulosclerosis

正確答案：B. Alport syndrome